Clinical trial inclusion criteria:
patients with FEV1 / FVC <70%

Annotated entities:
- Measurement: "FEV1 / FVC"
- Value: "<70%"